Clinical trial inclusion criterion:
Users of at least 2 cups of caffeinated coffee per day who are willing to be randomized to any of the interventions.

Entity relations:
- Has_multiplier("caffeinated coffee", "at least 2 cups per day")